Clinical trial exclusion criterion:
Follicle stimulating hormone > 20 IU/L

Entity relations:
- Has_value("Follicle stimulating hormone", "> 20 IU/L")